Clinical trial inclusion criterion:
Birilubin = 3mg/dl

Annotated entities:
- Measurement: "Birilubin"
- Value: "= 3mg/dl"